背部，右肩胛骨內側緣與脊椎的棘突（spinous process of vertebra）間外傷出血，最可能直接傷及下列何者的分支？
A. 肩胛上動脈（suprascapular artery）
B. 肩胛下動脈（subscapular artery）
C. 頸深動脈（deep cervical artery）
D. 頸橫動脈（transverse cervical artery）

正確答案：D. 頸橫動脈（transverse cervical artery）